Elevated blood-cholesterol

The above is a clinical trial inclusion criterion. Annotated with entity spans:
[Value: Elevated] [Measurement: blood-cholesterol]